Contraindications and/or known hypersensitivity to the active substance and/or any of the excipients of epoetin beta treatment

The above is a clinical trial exclusion criterion. Annotated with entity spans:
[Condition: Contraindications] and/or known [Condition: hypersensitivity] to the active substance and/or any of the excipients of [Procedure: epoetin beta treatment]